women undergoing IVF/ICSI or frozen embryo transfers (FET) that less than 40 years old.

The above is a clinical trial inclusion criterion. Annotated with entity spans:
[Person: women] undergoing [Procedure: IVF]/[Procedure: ICSI] or [Procedure: frozen embryo transfers (FET)] that [Value: less than 40 years] [Person: old].